Clinical trial exclusion criterion:
5. Hemoglobin < 10 g/dL

Annotated entities:
- Parsing_Error: "5."
- Measurement: "Hemoglobin"
- Value: "< 10 g/dL"